Clinical trial exclusion criterion:
18. Concomitant administration of oral contraceptives (may be included with 7-day washout period)

Entity relations:
- Has_temporal("oral contraceptives", "Concomitant")